Patients that have elected to have a nerve block

The above is a clinical trial inclusion criterion. Annotated with entity spans:
Patients that have [Mood: elected to have] a [Procedure: nerve block]